Acude a nuestra consulta un hombre de 54 años diagnosticado de diabetes mellitus tipo 2. Refiere fiebre de 40ºC con escalofríos y tiritona, artromialgias y cefalea por lo que ha iniciado tratamiento con paracetamol. El cuadro se inició 24 horas antes de su regreso a España. A los 3 días presenta un exantema máculo-papuloso generalizado que evoluciona a la formación de petequias más intenso en miembros inferiores. Aporta analítica donde destaca leucopenia con 3.200/mm3 y plaquetas 91.000/mm3 y elevación leve de aminotransferasas. La gota gruesa, extensión de sangre periférica, reacción en cadena de polimerasa (PCR) y antígeno de malaria son negativas. ¿Cuál es el diagnóstico de sospecha más probable?
1. Infección por coronavirus.
2. Coriomeningitis linfocitaria.
3. Dengue.
4. Infección por virus Chikungunya.
5. Encefalitis de Saint Louis.

Respuesta correcta: 3. Dengue.